一男子從東	亞返國一天後開始出現嘔吐、腹瀉症狀，因持續兩天嚴重水瀉而住院。病人隨後出現脫水、酸中毒和低血鉀等症候，糞便檢體培養出逗點狀彎曲、氧化酶（oxidase）陽性之細菌。此病患最有可能是感染了下列何種細菌？
A. 霍亂弧菌（Vibrio cholerae）
B. 痢疾志賀氏桿菌（Shigella dysenteriae）
C. 幽門桿菌（Helicobacter pylori）
D. 大腸桿菌（Escherichia coli）

正確答案：A. 霍亂弧菌（Vibrio cholerae）